Clinical trial exclusion criterion:
Chronic kidney disease (CrCl < 30ml/min)

Annotated entities:
- Condition: "Chronic kidney disease"
- Measurement: "CrCl"
- Value: "< 30ml/min"